Clinical trial exclusion criterion:
Clinically significant abnormal laboratory finding

Annotated entities:
- Non-query-able: "Clinically significant abnormal laboratory finding"